Clinical trial exclusion criterion:
Presence of a significant medical or psychiatric condition (Examples include: Diagnosis and treatment of tuberculosis (TB) or HIV; renal insufficiency; hepatic disease; oral or parenteral medication known to affect the immune function, such as corticosteroids, other immunosuppressant drugs; or behavioural or memory issues)

Annotated entities:
- Condition: "psychiatric condition"
- Condition: "medical condition"
- Qualifier: "significant"
- Condition: "tuberculosis (TB)"
- Condition: "HIV"
- Procedure: "treatment"
- Condition: "renal insufficiency"
- Condition: "hepatic disease"
- Drug: "parenteral medication"
- Drug: "oral medication"
- Qualifier: "known to affect the immune function"
- Drug: "corticosteroids"
- Drug: "immunosuppressant drugs"
- Qualifier: "other"
- Condition: "behavioural issues"
- Condition: "memory issues"